Clinical trial exclusion criterion:
Previous cervical ripening agents (cytotec, cervidil, cervical Foley Balloon)

Annotated entities:
- Temporal: "Previous"
- Drug: "cervical ripening agents"
- Drug: "cytotec"
- Drug: "cervidil"
- Device: "cervical Foley Balloon"